Clinical trial inclusion criterion:
measurable lesion by CT or other techniques according to RECIST

Entity relations:
- AND("measurable lesion", "CT")